hypoventilation

The above is a clinical trial exclusion criterion. Annotated with entity spans:
[Condition: hypoventilation]